Clinical trial exclusion criterion:
Leg ulcers of another underlying cause

Annotated entities:
- Condition: "Leg ulcers"
- Condition: "underlying cause"
- Qualifier: "another"